Clinical trial exclusion criterion:
Women of child bearing potential must be practicing effective contraception implemented during the trial and for at least 28 days following the last dose of study medication

Entity relations:
- Has_qualifier("contraception", "effective")
- AND("Women", "contraception")
- Has_multiplier("study medication", "last dose")
- multi("the last dose of study medication", "study medication")
- Has_index("for at least 28 days following the last dose of study medication", "the last dose of study medication")
- Has_temporal("contraception", "during the trial")
- Has_temporal("contraception", "for at least 28 days following the last dose of study medication")
- AND("child bearing potential", "contraception")